Clinical trial exclusion criterion:
having internal and surgical disease(after having variety of physical examination such as electrocardiogram/hepatic and renal function/blood routine and urine routine)

Entity relations:
- multi("surgical disease", "surgical")
- multi("having variety of physical examination such as electrocardiogram/hepatic and renal function/blood routine and urine routine", "physical examination")
- Has_index("after having variety of physical examination such as electrocardiogram/hepatic and renal function/blood routine and urine routine", "having variety of physical examination such as electrocardiogram/hepatic and renal function/blood routine and urine routine")
- Has_temporal("internal disease", "after having variety of physical examination such as electrocardiogram/hepatic and renal function/blood routine and urine routine")
- multi("having variety of physical examination such as electrocardiogram/hepatic and renal function/blood routine and urine routine", "electrocardiogram")
- multi("having variety of physical examination such as electrocardiogram/hepatic and renal function/blood routine and urine routine", "hepatic function")
- multi("having variety of physical examination such as electrocardiogram/hepatic and renal function/blood routine and urine routine", "renal function")
- multi("having variety of physical examination such as electrocardiogram/hepatic and renal function/blood routine and urine routine", "blood routine")
- multi("having variety of physical examination such as electrocardiogram/hepatic and renal function/blood routine and urine routine", "urine routine")
- OR("internal disease", "surgical disease")